Clinical trial exclusion criterion:
interstitial cystitis

Annotated entities:
- Condition: "interstitial cystitis"